Clinical trial exclusion criterion:
Surgeries that include: intradetrusor Botox, vaginal mesh excision, and fistula repair

Annotated entities:
- Drug: "Botox"
- Qualifier: "intradetrusor"
- Procedure: "vaginal mesh excision"
- Device: "vaginal mesh"
- Procedure: "fistula repair"